Non-cephalic presentation

The above is a clinical trial exclusion criterion. Annotated with entity spans:
[Condition: Non-cephalic presentation]